En la fase II de la dieta por una gastroenteritis aguda ¿qué alimento hay que evitar?:
1. Patata.
2. Pan tostado.
3. Uva.
4. Membrillo.
5. Sémola.

Respuesta correcta: 3. Uva.